Clinical trial exclusion criterion:
History of significant neurologic or psychiatric disorders including dementia or seizures

Annotated entities:
- Condition: "neurologic disorders"
- Condition: "psychiatric disorders"
- Condition: "dementia"
- Condition: "seizures"
- Temporal: "History"